age 35-75 years;

The above is a clinical trial inclusion criterion. Annotated with entity spans:
[Person: age] [Value: 35-75 years];